Clinical trial inclusion criteria:
Chronic hepatitis B (HBsAg positive > 6 months)
HBeAg negative within six months prior to initiation of peginterferon alfa-2a
HBV DNA < 200 IU/ml during nucleos(t)ide analogue (except Telbivudine) treatment within one month prior to initiation of peginterferon alfa-2a
Compensated liver disease
Age > 18 years
Written informed consent

Annotated entities:
- Condition: "Chronic hepatitis B"
- Measurement: "HBsAg"
- Value: "positive"
- Temporal: "> 6 months"
- Measurement: "HBeAg"
- Value: "negative"
- Temporal: "within six months prior to initiation of peginterferon alfa-2a"
- Reference_point: "initiation of peginterferon alfa-2a"
- Drug: "peginterferon alfa-2a"
- Measurement: "HBV DNA"
- Value: "< 200 IU/ml"
- Temporal: "within one month prior to initiation of peginterferon alfa-2a"
- Reference_point: "initiation of peginterferon alfa-2a"
- Drug: "peginterferon alfa-2a"
- Drug: "nucleos(t)ide analogue"
- Drug: "Telbivudine"
- Negation: "except"
- Temporal: "during nucleos(t)ide analogue (except Telbivudine) treatment"
- Reference_point: "nucleos(t)ide analogue (except Telbivudine) treatment"
- Condition: "liver disease"
- Qualifier: "Compensated"
- Person: "Age"
- Value: "> 18 years"
- Informed_consent: "Written informed consent"